Clinical trial exclusion criterion:
patients with concomitant use of IUDs.

Annotated entities:
- Drug: "IUDs"